Clinical trial exclusion criterion:
ALT(Alanine aminotransferase) level of liver function test exceeded 5 times of reference range

Entity relations:
- AND("liver function test", "ALT(Alanine aminotransferase) level")
- Has_value("ALT(Alanine aminotransferase) level", "exceeded 5 times of reference range")